Clinical trial inclusion criterion:
Tumor equal or below 10 cm from the anal verge, candidates to (ETM) low anterior resection and anastomosis, with or without preoperative chemo-radiotherapy.

Annotated entities:
- Qualifier: "equal or below 10 cm from the anal verge"
- Mood: "candidates"
- Procedure: "low anterior resection"
- Procedure: "low anterior anastomosis"
- Temporal: "preoperative"
- Procedure: "chemo-radiotherapy"
- Condition: "Tumor"